has agreed to continue adequate contraception during the entire treatment period and for 1 month, after completion of the vaccination series.

The above is a clinical trial inclusion criterion. Annotated with entity spans:
has agreed to [Multiplier: continue] [Observation: adequate contraception] [Temporal: during the entire treatment period] and [Temporal: for 1 month, after completion of the vaccination series].